¿Cuántos           estereoisómeros           del 3-metilciclohexano-1, 2-diol pueden existir?
1. 4.
2. 5.
3. 6.
4. 7.
5. 8.

Respuesta correcta: 5. 8.